What is the mode of action of Tetrocarcin-A?

The anti-tumor antibiotic, tetrocarcin A, directly induces apoptosis of human breast cancer cells.